Clinical trial exclusion criterion:
Patients who have received a transplant besides liver.

Annotated entities:
- Procedure: "transplant"
- Qualifier: "liver"